18-35 years old

The above is a clinical trial inclusion criterion. Annotated with entity spans:
[Value: 18-35 years] [Person: old]